Clinical trial inclusion criterion:
Histological evidence: FL Grade 1-3A/iNHL, with relapsed or refractory disease (iNHL includes LPL/WM, MZL); aNHL, defined as DLBCL, FL Grade 3B, MCL, and transformed NHL with relapsed disease; CLL/SLL, PTCL, or CTCL (with MF/SS) with relapsed or refractory.

Annotated entities:
- Procedure: "Histological"
- Condition: "FL"
- Measurement: "Grade"
- Value: "1-3A"
- Condition: "iNHL"
- Condition: "refractory disease"
- Condition: "relapsed disease"
- Condition: "iNHL"
- Condition: "LPL"
- Condition: "WM"
- Condition: "MZL"
- Condition: "aNHL"
- Condition: "DLBCL"
- Condition: "FL"
- Measurement: "Grade"
- Value: "3B"
- Condition: "MCL"
- Condition: "transformed NHL"
- Condition: "relapsed disease"
- Condition: "CLL"
- Condition: "SLL"
- Condition: "PTCL"
- Condition: "CTCL"
- Condition: "MF"
- Condition: "SS"